a known allergy to dexmedetomidine hydrochloride

The above is a clinical trial exclusion criterion. Annotated with entity spans:
a known [Condition: allergy] to [Drug: dexmedetomidine hydrochloride]